Neurological Congenital malformations and/or those known to impair intestinal motility

The above is a clinical trial exclusion criterion. Annotated with entity spans:
[Condition: Neurological Congenital malformations] and/or those known to [Condition: impair intestinal motility]